¿Se pueden realizar valoraciones amperométricas con dos electrodos indicadores de la misma naturaleza?
1. No, necesitamos siempre de un electrodo de referencia.
2. Sí, si entre los dos electrodos existe una diferencia de potencial constante.
3. Sí, si los dos electrodos fueran de paladio.
4. No, este tipo de valoraciones no existen.

Respuesta correcta: 2. Sí, si entre los dos electrodos existe una diferencia de potencial constante.